Clinical trial inclusion criterion:
fibrin-specific fibrinolytic therapy less than 24 h before randomization, non-fibrin-specific fibrinolytic therapy less than 48 h before randomization

Entity relations:
- Has_qualifier("fibrinolytic therapy", "fibrin-specific")
- Has_qualifier("fibrinolytic therapy", "non-fibrin-specific")
- Has_temporal("fibrinolytic therapy", "less than 48 h before randomization")
- Has_temporal("fibrinolytic therapy", "less than 24 h before randomization")
- Has_index("less than 24 h before randomization", "randomization")
- Has_index("less than 48 h before randomization", "randomization")
- OR("fibrinolytic therapy", "fibrinolytic therapy")